Clinical trial exclusion criterion:
Previous pelvic or abdominal radiotherapy

Entity relations:
- Has_temporal("pelvic radiotherapy", "Previous")
- OR("pelvic radiotherapy", "abdominal radiotherapy")